Clinical trial exclusion criterion:
Patients with planned concomitant surgical or transcatheter ablation for Atrial Fibrillation.

Entity relations:
- Has_temporal("surgical ablation", "concomitant")
- Has_mood("surgical ablation", "planned")
- AND("surgical ablation", "Atrial Fibrillation")
- OR("surgical ablation", "transcatheter ablation")